Clinical trial exclusion criterion:
Platelet count higher than 30x109/l at time of screening

Entity relations:
- Has_index("at time of screening", "screening")
- Has_value("Platelet count", "higher than 30x109/l")
- Has_temporal("Platelet count", "at time of screening")